30 歲之氣喘患者平時已規則使用低劑量之吸入型類固醇來控制病情，但仍常有急性氣喘發作之情形，每天皆須使用 3-4 次以上短效之支氣管擴張劑來控制病情。請問此時應再加入下列何種藥物最為適當？
A. 每天規則使用長效吸入型之乙二型交感神經刺激劑
B. 每天使用口服茶鹼
C. 長期口服類固醇
D. 規則使用吸入抗膽鹼藥物

正確答案：A. 每天規則使用長效吸入型之乙二型交感神經刺激劑